Patients who have received the PPSV23 vaccine in the last 5 years

The above is a clinical trial exclusion criterion. Annotated with entity spans:
Patients who have received the [Drug: PPSV23 vaccine] [Temporal: in the last 5 years]